Clinical trial exclusion criterion:
(3)History of adverse reactions or intolerance to enalapril or other ACE inhibitors, or drugs or supplements containing folic acid;

Entity relations:
- Has_qualifier("ACE inhibitors", "other")
- AND("adverse reactions", "enalapril")
- Has_temporal("adverse reactions", "History")
- OR("enalapril", "ACE inhibitors", "folic acid")
- OR("adverse reactions", "intolerance")